在正常健康人體周邊血（peripheral blood）中之何種細胞最多？
A. T淋巴細胞
B. B淋巴細胞
C. 漿細胞（plasma cell）
D. 自然殺手細胞

正確答案：A. T淋巴細胞